Clinical trial exclusion criterion:
Form of diagnosed psoriasis other than chronic plaque psoriasis (i.e. guttate, erythrodermic, pustular)

Entity relations:
- Has_negation("chronic plaque psoriasis", "other than")
- Subsumes("chronic plaque psoriasis", "guttate")
- AND("psoriasis", "chronic plaque psoriasis")
- OR("guttate", "erythrodermic", "pustular")